Clinical trial exclusion criterion:
Cardiac ischemia, cardiac arrhythmias or congestive heart failure uncontrolled by medication

Annotated entities:
- Condition: "Cardiac ischemia"
- Condition: "cardiac arrhythmias"
- Condition: "congestive heart failure"
- Qualifier: "uncontrolled by medication"